Patient with contra-indication to: dipyridamole, aminophylline, dobutamine or exercise stress test (depending on the method of cardiovascular stress test chosen)

The above is a clinical trial exclusion criterion. Annotated with entity spans:
Patient with [Condition: contra-indication] to: [Drug: dipyridamole], [Drug: aminophylline], [Drug: dobutamine] or [Procedure: exercise stress test] (depending on the method of cardiovascular stress test chosen)